Clinical trial inclusion criterion:
Acute Myocardial Infarction Undergoing Primary percutaneous coronary intervention.

Annotated entities:
- Condition: "Acute Myocardial Infarction"
- Procedure: "Primary percutaneous coronary intervention"